Clinical trial exclusion criterion:
Present alcoholism or drug abuse or use of medications that could interfere with the treatment including bronchodilators, quinolone antibiotics, monoamine oxidase inhibitors, anxiolytics, ranitidine, corticosteroids, growth hormone, antihypertensives.

Annotated entities:
- Condition: "alcoholism"
- Condition: "drug abuse"
- Drug: "medications that could interfere with the treatment"
- Drug: "bronchodilators"
- Drug: "quinolone antibiotics"
- Drug: "monoamine oxidase inhibitors"
- Drug: "anxiolytics"
- Drug: "ranitidine"
- Drug: "corticosteroids"
- Drug: "growth hormone"
- Drug: "antihypertensives"